23 歲白小姐，身高 163 公分，體重 45 公斤，就讀大學夜間部，主訴近 2～3 個月來落髮嚴重、體重減輕、心悸、手抖、不易入睡且睡眠易醒的狀況，常因身體不適，而與家人的互動逐漸減少，從小帶她長大的奶奶，看到這種情形覺得非常憂心，在多次勸導下，終於願意來門診求醫。理學及一般血液檢查與甲狀腺功能檢測皆無異常。下列處理措施何者較適當？
A. 保證無身體問題，給予症狀治療
B. 建立醫病關係以進一步詢問生活壓力事件
C. 因體重減輕以及落髮嚴重，照會內分泌專科醫師
D. 因心悸問題，照會心臟科專科醫師

正確答案：B. 建立醫病關係以進一步詢問生活壓力事件